Clinical trial exclusion criterion:
Systemic therapy or radiotherapy within 4 weeks prior to Day 1

Entity relations:
- Has_temporal("Systemic therapy", "within 4 weeks prior to Day 1")
- Has_index("within 4 weeks prior to Day 1", "Day 1")
- OR("Systemic therapy", "radiotherapy")
- OR("within 4 weeks prior to Day 1", "Day 1")